English or Spanish literate

The above is a clinical trial inclusion criterion. Annotated with entity spans:
[Non-query-able: English or Spanish literate]